Pregnant patients

The above is a clinical trial exclusion criterion. Annotated with entity spans:
[Condition: Pregnant] patients